下列用來治療癌症的抗體，何者屬於checkpoint blockade療法？
A. Avastin（anti-VEGF antibody）
B. Pembrolizumab（anti-PD-1 antibody）
C. Rituximab（anti-CD20 antibody）
D. Trastuzumab（anti-HER2/neu antibody）

正確答案：B. Pembrolizumab（anti-PD-1 antibody）